Clinical trial exclusion criterion:
Severe cognitive impairment (defined as score = 5 on the Short Portable Mental Status Questionnaire)

Entity relations:
- Has_qualifier("cognitive impairment", "Severe")
- Has_value("Short Portable Mental Status Questionnaire", "= 5")
- Subsumes("cognitive impairment", "Short Portable Mental Status Questionnaire")